Respecto al abuso de sustancias por                 el adolescente señale la respuesta correcta:
1. Suele ser un consumo individual lo cual indica un mejor pronóstico.
2. El inicio del abuso en la adolescencia no ha demostrado un mayor riesgo de convertirse en adicto.
3. Es independiente del riesgo de contagio por el VIH.
4. La droga más popular entre los adolescentes es el cannabis.
5. Debe considerarse en adolescentes que llegan a la Urgencia con una crisis comicial.

Respuesta correcta: 5. Debe considerarse en adolescentes que llegan a la Urgencia con una crisis comicial.